Mujer de 33 años con cuadro de pérdida de 6 Kg de peso en los últimos 4 meses, astenia y anorexia. Amenorrea desde hace 2 meses. Los resultados     hormonales      indican    una concentración sérica de cortisol basal de 108 nmol/l (valor normal basal 115-550) y de 123 nmol/l tras estimulación con ACTH. La concentración plasmática basal de ACTH es de 48 pmol/l (valor normal: 2-12). ¿Cuál es el diagnóstico mas probable?
1. Insuficiencia suprarrenal primaria.
2. Insuficiencia suprarrenal secundaria.
3. Insuficiencia suprarrenal terciaria por lesión hipotalámica.
4. Tumor hipofisario productor de ACTH (corticotropinoma).
5. Se deben practicar más pruebas dado que el diagnóstico no es concluyente.

Respuesta correcta: 1. Insuficiencia suprarrenal primaria.